Leuprolide 通常使用於下列何種疾病之治療？
A. Hodgkin's lymphoma
B. lung cancer
C. prostate cancer
D. pancreatic cancer

正確答案：C. prostate cancer